下列何種病毒之基因體為 DNA，並可造成幼兒傳染性紅疹症（erythema infectiosum）？
A. 人類細小病毒（parvovirus）B19
B. 德國麻疹病毒（Rubella virus）
C. 麻疹病毒（Measles virus）
D. 伊柯病毒（Echovirus）第十六型

正確答案：A. 人類細小病毒（parvovirus）B19